Any major surgical procedure in the preceding 30 days.

The above is a clinical trial exclusion criterion. Annotated with entity spans:
Any [Procedure: major surgical procedure] in the [Temporal: preceding 30 days].